Clinical trial exclusion criterion:
9. Previous myocardial infarction in the distribution of the target vessel for the FFR

Entity relations:
- Has_temporal("myocardial infarction", "Previous")
- Has_qualifier("myocardial infarction", "in the distribution of the target vessel")